Clinical trial exclusion criterion:
16. Concomitant administration of any food product known to alter P450 enzyme or P-gp activity such as grapefruit juice, Seville oranges

Entity relations:
- Subsumes("food product known to alter P-gp activity", "grapefruit juice")
- Has_temporal("food product known to alter P-gp activity", "Concomitant")
- OR("food product known to alter P-gp activity", "food product known to alter P450 enzyme activity")
- OR("grapefruit juice", "Seville oranges")